下列有關胎血循環的敘述，何項錯誤？
A. 臍靜脈將充氧血自胎盤攜至胎兒
B. 臍動脈將減氧血自胎兒攜至胎盤
C. 進入右心房的血液可不經右心室而到達左心房
D. 動脈導管可將主動脈血液導入肺動脈循環

正確答案：D. 動脈導管可將主動脈血液導入肺動脈循環